Clinical trial exclusion criterion:
Subjects participating another interventional clinical trial within 30 days prior to screening.

Annotated entities:
- Competing_trial: "Subjects participating another interventional clinical trial within 30 days prior to screening."